Clinical trial exclusion criterion:
2. The subject has pre-existing sustained supine hypertension greater than 180mmHg systolic and 110mmHg diastolic BP or had these measurements at the Screening Visit. Sustained is defined as persistently greater at 2 separate measurements at least 5 minutes apart with the subject supine and at rest for the 5 minutes.

Entity relations:
- Has_value("BP", "110mmHg diastolic")
- Has_value("BP", "greater than 180mmHg systolic")
- Has_index("at the Screening Visit", "Screening Visit")
- Has_temporal("supine hypertension", "pre-existing")
- AND("supine hypertension", "BP")
- Has_temporal("supine hypertension", "sustained")
- Has_multiplier("measurements", "2 separate at least 5 minutes apart")
- OR("sustained", "at the Screening Visit")